Active or recent drug or alcohol abuse

The above is a clinical trial exclusion criterion. Annotated with entity spans:
[Temporal: Active] or [Temporal: recent] [Condition: drug] or [Condition: alcohol abuse]